HbA1c greater than 75 mmol/mol (9.0%)

The above is a clinical trial exclusion criterion. Annotated with entity spans:
[Measurement: HbA1c] [Value: greater than 75 mmol/mol] ([Value: 9.0%])